Se obtienen sólo por síntesis química las/los:
1. Penicilinas.
2. Cefalosporinas.
3. Macrólidos.
4. Aminoglucósidos.
5. Quinolonas.

Respuesta correcta: 5. Quinolonas.